Clinical trial exclusion criterion:
Arrhythmia

Annotated entities:
- Condition: "Arrhythmia"